下列何者是創傷後壓力疾患最不常使用的心理防衛機轉？
A. 合理化作用
B. 否認作用
C. 投射作用
D. 解離作用

正確答案：A. 合理化作用